Clinical trial inclusion criterion:
Total bilirubin < 1.5 x upper limit of normal

Entity relations:
- Has_value("Total bilirubin", "< 1.5 x upper limit of normal")